Dracorhodin perchlorate was tested for treatment of which cancers?

Dracorhodin perchlorate induce apoptosis in prostate cancer, gastric tumor, melanoma and premyelocytic leukemia.